Which conditions are manifested by TRIM8 mutations?

Mutations in TRIM8 gene have been described in patients with severe developmental delay, epileptic encephalopathy, developmental delay and intellectual disability.